Linguistic barrier or psychological profile preventing the patient from signing the consent form.

The above is a clinical trial exclusion criterion. Annotated with entity spans:
[Observation: Linguistic barrier] or [Condition: psychological profile] [Negation: preventing] the patient from [Informed_consent: signing the consent form].